Clinical trial exclusion criterion:
The pregnant or lactating woman

Annotated entities:
- Pregnancy_considerations: "The pregnant or lactating woman"